Clinical trial inclusion criterion:
7. When available, subjects will be screened for stability of blood CD4 and HIV RNA levels.

Annotated entities:
- Not_a_criteria: "When available, subjects will be screened for stability of blood CD4 and HIV RNA levels."